Acude a una revisión programada encontrándose asintomático un hombre de 50 años diagnosticado de poliangeitis con granulomatosis 10 años antes y sin tratamiento desde hace 5. La radiografía de tórax, análisis de sangre y sedimento de orina son normales salvo unos anticuerpos anticitoplasma del neutrófilo (ANCA) positivos a título 1/320, con especificidad antiproteinasa 3, que previamente se habían negativizado. ¿Cuál es la actitud terapéutica más aconsejable?
1. Iniciar tratamiento con corticoides.
2. Iniciar tratamiento con ciclofosfamida.
3. Iniciar tratamiento con micofenolato de mofetilo.
4. Vigilancia expectante.

Respuesta correcta: 4. Vigilancia expectante.